La oxidación de Baeyer-Villiger, es un procedimiento importante para transformar las cetonas en:
1. Ácidos.
2. Aldehídos.
3. Ésteres.
4. Éteres.
5. Alquenos.

Respuesta correcta: 3. Ésteres.